Clinical trial exclusion criterion:
asthma and COPD

Annotated entities:
- Condition: "asthma"
- Condition: "COPD"